26歲陳小姐在一家化學工廠擔任會計的工作，3個月來一到黃昏右眼皮就會往下垂，晚上看電視時，影像顯得模糊不清，稍作休息會有所改善；這2天喝水常會嗆到，因情況持續，而至門診求助。最可能的診斷為何？
A. 重症肌無力症（myasthenia gravis）
B. 多發性肌炎（polymyositis）
C. 多發性顱神經病變
D. 代謝性肌病變

正確答案：A. 重症肌無力症（myasthenia gravis）